今年 50 歲之長期糖尿病患者，主訴劇烈咳嗽後兩眼前有"黑影＂出現，最有可能發生之情況是：
A. 玻璃體液化（Vitreous liquification）
B. 水晶體混濁（Crystalline lens opacities）
C. 視網膜剝離（Retinal detachment）
D. 視網膜出血（Retinal hemorrhage）

正確答案：D. 視網膜出血（Retinal hemorrhage）